自然產之7天大嬰兒，出現嘔吐及進食困難症狀，身體診察發現有角弓反張（opisthotonos），實	室檢查有低血糖現象，尿液檢查正常，	水有一奇特的味道，病人有代謝性酸中毒。最可能的診斷為：
A. 腎小管性酸中毒（renal tubular acidosis）
B. 楓糖尿症（maple syrup urine disease）
C. Arnold-Chiari氏畸型（Arnold-Chiari malformation）
D. 先天性甲狀腺功能低下症（congenital hypothyroidism）

正確答案：B. 楓糖尿症（maple syrup urine disease）